Hepatitis B or C carrier status

The above is a clinical trial exclusion criterion. Annotated with entity spans:
[Condition: Hepatitis B] or C carrier status